Clinical trial inclusion criterion:
Early, intermediate, advanced, non metastatic Hepatocellular Carcinoma. Indication for radioembolization validated after pluridisciplinary committee meeting.

Annotated entities:
- Condition: "Hepatocellular Carcinoma"
- Negation: "non"
- Qualifier: "metastatic"
- Qualifier: "advanced"
- Qualifier: "intermediate"
- Qualifier: "Early"
- Procedure: "radioembolization"
- Observation: "Indication"
- Subjective_judgement: "Indication"
- Non-query-able: "validated after pluridisciplinary committee meeting"